Acute coronary syndrome, stroke, transient ischaemic attack, cardiac, carotid, or other major cardiovascular surgery, percutaneous coronary intervention, or carotid angioplasty within the 3 months.

The above is a clinical trial exclusion criterion. Annotated with entity spans:
[Condition: Acute coronary syndrome], [Condition: stroke], [Condition: transient ischaemic attack], [Condition: cardiac], [Condition: carotid], or other [Procedure: major cardiovascular surgery], [Procedure: percutaneous coronary intervention], or [Procedure: carotid angioplasty] [Temporal: within the 3 months].